目前使用單株抗體的生物製劑治療多種自體免疫病及其他多種疾病，都有長足的進步。不過這些單株抗體製劑都要有擬人化（humanized）的步驟，才能用於人體。這個步驟為何？
A. 先與人類補體結合，是為擬人化步驟
B. 先通過存有移除型抗體（depleting antibodies）的介面做為純化步驟，才得到擬人化的單株抗體
C. 通過存有抗淋巴球球蛋白（anti-lymphocyte globulin）的介面做為純化步驟
D. 將其他物種單株抗體基因的互補決定區域（complementary-determining regions, CDRs）部分，轉殖到人類單株抗體基因的互補決定區域（CDRs）部分

正確答案：D. 將其他物種單株抗體基因的互補決定區域（complementary-determining regions, CDRs）部分，轉殖到人類單株抗體基因的互補決定區域（CDRs）部分